下列那一種細菌最常見於 Xanthogranulomatous pyelonephritis？
A. Staphylococcus aureus
B. Pseudomonas aeruginosa
C. Klebsiella pneumoniae
D. Proteus mirabilis

正確答案：D. Proteus mirabilis